Clinical trial inclusion criterion:
non-valvular atrial fibrillation

Entity relations:
- Has_qualifier("atrial fibrillation", "non-valvular")